Clinical trial inclusion criterion:
Only children well enough to be discharged to home at the conclusion of the PED visit are eligible.

Annotated entities:
- Condition: "well enough to be discharged to home"
- Temporal: "at the conclusion of the PED visit"
- Reference_point: "the conclusion of the PED visit"
- Visit: "PED"